Clinical trial inclusion criterion:
Healthy adults 30- 65 years old,

Entity relations:
- Has_value("old", "30- 65 years old")